關於肛門瘻管（anal fistula）的敘述，何者錯誤？
A. Goodsall's rule 有助於內口（internal orifice）位置的定位
B. 所有的肛門瘻管皆可以安全地手術切除
C. 男女發生率不同
D. 肛門腺體發炎是主要成因

正確答案：B. 所有的肛門瘻管皆可以安全地手術切除